Clinical trial exclusion criterion:
diseases/drugs that influence on autonomic nervous system activity

Entity relations:
- Has_qualifier("drugs", "influence on autonomic nervous system activity")
- Has_qualifier("diseases", "influence on autonomic nervous system activity")
- OR("diseases", "drugs")